Subject understands and is willing, able, and likely to comply with study procedures and restrictions.

The above is a clinical trial inclusion criterion. Annotated with entity spans:
[Non-query-able: Subject understands and is willing, able, and likely to comply with study procedures and restrictions.]